Unable to perform questionnaire

The above is a clinical trial exclusion criterion. Annotated with entity spans:
[Observation: Unable to perform questionnaire]